Clinical trial exclusion criterion:
Hb level < 9gm/dl

Annotated entities:
- Measurement: "Hb level"
- Value: "< 9gm/dl"